Clinical trial exclusion criterion:
Dementia: Diagnosis of dementia by DSM-IV;

Entity relations:
- Has_qualifier("Dementia", "DSM-IV")